Clinical trial inclusion criterion:
ASA classification II or III females

Entity relations:
- Has_value("ASA classification", "II or III")